腦膜瘤（Meningioma）的主要治療方法是：
A. 手術摘除
B. 放射線治療
C. 化療
D. 荷爾蒙療法

正確答案：A. 手術摘除